Drug and / or alcohol abusers

The above is a clinical trial exclusion criterion. Annotated with entity spans:
[Condition: Drug] and / or [Condition: alcohol abusers]